常見的滋養層細胞疾病（gestational trophoblastic disease）的臨床表現是：
A. 咳嗽
B. 陰道出血
C. 腹痛
D. 血栓

正確答案：B. 陰道出血